Clinical trial exclusion criterion:
History of corticosteroid injection to affected shoulder within the last 3 months

Annotated entities:
- Procedure: "corticosteroid injection"
- Temporal: "last 3 months"
- Qualifier: "shoulder"
- Temporal: "History of"